Todos programas de entrenamiento en Habilidades Sociales suelen incluir 5 componentes básicos ¿Cuál de los siguientes elementos terapéuticos no está incluido entre esos cinco por no ser un elemento característico de este tipo de entrenamiento?:
1. Reforzamiento.
2. Ensayo de conducta.
3. Retroalimentación o feedback de la ejecución.
4. Reestructuración cognitiva.

Respuesta correcta: 4. Reestructuración cognitiva.